Clinical trial inclusion criterion:
FIBRO Spect II Index consistent with F0- F2 AND APRI of = 1 during Screening

Annotated entities:
- Measurement: "FIBRO Spect II Index"
- Value: "F0- F2"
- Measurement: "APRI"
- Value: "= 1"
- Temporal: "during Screening"